34 歲陳先生，與太太結婚 6 年一直沒有生小孩，陳先生到泌尿科檢查，精液分析發現沒有精蟲，而且精液量少，pH 值為 7.0。醫師檢查記載兩側陰囊內摸不到輸精管。陳先生最可能之診斷為：
A. 副睪丸（epididymitis）後引起兩側副睪小管阻塞
B. 射精管阻塞
C. 逆流式射精（retrograde ejaculation）
D. 先天兩側無輸精管（congenital bilateral absence of vas deferens）

正確答案：D. 先天兩側無輸精管（congenital bilateral absence of vas deferens）